staging IIB

The above is a clinical trial inclusion criterion. Annotated with entity spans:
[Qualifier: staging IIB]